clomiphene通常對下列那一種排卵異常的不孕症患者，誘發排卵的效果較差？
A. 厭食症
B. 多囊性卵巢症候群
C. 泌乳激素過高
D. 不明原因不孕症

正確答案：A. 厭食症